一位 40 歲男性常有復發性鼻竇感染，檢驗數據顯示紅血球沉降速率（erythrocyte sedimentation rate）上升。抗中性球細胞質抗體（antineutrophil cytoplasmic antibodies; ANCA）呈現陽性細胞質型（positive cytoplasmic ANCA），但核周型（perinuclear）ANCA 呈陰性。病人同時發生快速腎功能變壞及少尿 （oliguria）。下列病理變化中何者最能代表其腎臟血管病變？
A. 壞死性或肉芽腫性血管炎（necrotizing or granulomatous vasculitis）
B. 白血球破裂性血管炎（leukocytoclastic vasculitis）
C. 巨細胞血管炎（giant cell vasculitis）
D. 嗜伊紅性血管炎（eosinophilic angiitis）

正確答案：A. 壞死性或肉芽腫性血管炎（necrotizing or granulomatous vasculitis）